Clinical trial exclusion criterion:
STEMI due to bypass-graft occlusion

Entity relations:
- AND("occlusion", "bypass-graft")
- AND("STEMI", "occlusion")